Medical condition with safety deemed to be category 3 or 4 when using a combined hormonal contraceptive, as determined by the Center for Disease Control Medical Eligibility Criteria: current or past history of breast cancer, severe decompensated cirrhosis, history of deep vein thrombosis or pulmonary embolus, diabetes with nephropathy/retinopathy/neuropathy or other vascular disease diagnosed more than 20 years ago, current symptomatic gallbladder disease, hypertension, ischemic heart disease, known thrombogenic mutations, hepatocellular adenoma, malignant hepatoma, multiple risk factors for atherosclerotic cardiovascular disease, multiple sclerosis with prolonged immobility, history of peripartum cardiomyopathy, cigarette smoking and =35yo, history of complicated solid organ transplant, history of stroke, history of superficial venous thrombosis not associated with catheter, systemic lupus erythematosus with positive antiphospholipid antibodies, valvular heart disease complicated by pulmonary hypertension or atrial fibrillation or bacterial endocarditis, and acute viral hepatitis

The above is a clinical trial exclusion criterion. Annotated with entity spans:
[Condition: Medical condition] with [Measurement: safety] deemed to be category [Value: 3 or 4] when using a [Drug: combined hormonal contraceptive], as determined by the [Measurement: Center for Disease Control Medical Eligibility Criteria]: [Temporal: current] or [Temporal: past] [Temporal: history] of [Condition: breast cancer], [Qualifier: severe] [Qualifier: decompensated] [Condition: cirrhosis], [Temporal: history] of [Condition: deep vein thrombosis] or [Condition: pulmonary embolus], [Condition: diabetes] with [Condition: nephropathy]/[Condition: retinopathy]/[Condition: neuropathy] or [Qualifier: other] [Condition: vascular disease] diagnosed [Temporal: more than 20 years ago], [Temporal: current] [Qualifier: symptomatic] [Condition: gallbladder disease], [Condition: hypertension], [Condition: ischemic heart disease], known [Condition: thrombogenic mutations], [Condition: hepatocellular adenoma], [Condition: malignant hepatoma], [Multiplier: multiple] [Mood: risk factors] for [Condition: atherosclerotic cardiovascular disease], [Condition: multiple sclerosis] with [Condition: prolonged immobility], [Temporal: history] of [Condition: peripartum cardiomyopathy], [Observation: cigarette smoking] and [Value: =35yo], [Temporal: history] of [Procedure: complicated solid organ transplant], [Temporal: history] of [Condition: stroke], [Temporal: history] of [Condition: superficial venous thrombosis] [Qualifier: not associated] with [Device: catheter], [Condition: systemic lupus erythematosus] with [Value: positive] [Measurement: antiphospholipid antibodies], [Condition: valvular heart disease] complicated by [Condition: pulmonary hypertension] or [Condition: atrial fibrillation] or [Condition: bacterial endocarditis], and [Condition: acute viral hepatitis]